Clinical trial exclusion criterion:
Subject with a severe chronic or acute liver disease, history of moderate (Child-Pugh B), or severe (Child-Pugh C) hepatic impairment

Entity relations:
- Has_qualifier("chronic liver disease", "severe")
- Has_qualifier("hepatic impairment", "severe")
- Has_qualifier("hepatic impairment", "moderate")
- AND("hepatic impairment", "Child-Pugh")
- Has_value("Child-Pugh", "B")
- AND("hepatic impairment", "Child-Pugh")
- Has_value("Child-Pugh", "C")
- OR("chronic liver disease", "acute liver disease")